¿Mediante qué norma jurídica se regularon por primera vez las especialidades para los/as Diplomados/as en Enfermería y la obtención del título de Enfermero/a Especialista?
1. Orden 1 de junio de 1992 (BOE 2 de junio).
2. Real Decreto 450/2005, de 22 de abril (BOE 6 de mayo).
3. Real Decreto 992/1987, de 3 de julio (BOE 1 de agosto).
4. Real Decreto 943/1986 (BOE 14 de mayo).
5. Orden de 15 de julio de 1980 (BOE de 23 de julio).

Respuesta correcta: 3. Real Decreto 992/1987, de 3 de julio (BOE 1 de agosto).